Clinical trial exclusion criterion:
Chronic heart failure NYHA class III or IV

Annotated entities:
- Measurement: "NYHA"
- Value: "class III or IV"
- Condition: "Chronic heart failure"